Clinical trial exclusion criterion:
Operations in the past 6 months which could limit the erectile function

Entity relations:
- Has_temporal("Operations", "in the past 6 months")
- AND("Operations", "limit the erectile function")